Clinical trial exclusion criterion:
Receiving antibiotic and/or probiotic, 8 weeks before the study

Annotated entities:
- Drug: "antibiotic"
- Drug: "probiotic"
- Temporal: "8 weeks before the study"
- Reference_point: "the study"